Clinical trial exclusion criteria:
A diagnosis of sleep disordered breathing;
Nocturnal oxygen therapy.

Annotated entities:
- Condition: "sleep disordered breathing"
- Procedure: "Nocturnal oxygen therapy"